Clinical trial exclusion criterion:
Severe hepatic impairment.

Entity relations:
- Has_qualifier("hepatic impairment", "Severe")